Clinical trial inclusion criteria:
The study will include 40 post-deep peel women (exoderm), older than 18 years old, treated by the same dermatologist (dr. Landau).
The treatment group will receive 5 consecutive daily hyperbaric treatments, 1 hours long each, at 2 ATF, starting from day 7 to peel. Prior to treatment, each patient will be signed on informed consent and will have complete physical examination.
The control group will be matched by the following parameters: age, skin color and type, and indication for peeling, and will be picked up by the dermatologist.

Annotated entities:
- Condition: "deep peel"
- Person: "women"
- Condition: "exoderm"
- Value: "older than 18 years"
- Person: "old"
- Non-representable: "The treatment group will receive 5 consecutive daily hyperbaric treatments, 1 hours long each, at 2 ATF, starting from day 7 to peel."
- Observation: "control group"
- Person: "age"
- Person: "skin color"
- Person: "type"